Clinical trial exclusion criterion:
Women of childbearing potential must not be pregnant, planning to become pregnant during the study period, or nursing.

Entity relations:
- Has_temporal("nursing", "during the study period")
- Has_mood("pregnant", "planning to become")
- Has_negation("pregnant", "not be")
- AND("childbearing potential", "pregnant")
- AND("childbearing potential", "Women")
- OR("pregnant", "nursing", "pregnant")